關於成人型多囊性腎（Adult polycystic kidney disease）之敘述，下列何者錯誤？
A. 為性聯遺傳病
B. 常伴有高血壓
C. 1/10 病人會發生蜘蛛網膜下出血（Subarachnoid hemorrhage）
D. 囊腫可見於其他器官，如肝、脾、胰等

正確答案：A. 為性聯遺傳病